Which gene is responsible for red hair?

Variants of the melanocyte-stimulating hormone receptor gene are associated with red hair and fair skin in humans. Individuals with red hair have a predominance of phaeomelain in hair and skin and/or a reduced ability to produce eumelanin, which may explain why they fail to tan and are at risk from UVR.